Patients meet criteria for low to moderate risk for moderate exercise based oon the ACSM guidelines.

The above is a clinical trial inclusion criterion. Annotated with entity spans:
Patients meet criteria for [Value: low] to [Value: moderate] [Measurement: risk for moderate exercise] based oon the [Measurement: ACSM guidelines].